Clinical trial exclusion criterion:
Mechanical tricuspid heart valve

Annotated entities:
- Device: "Mechanical tricuspid heart valve"